Known hypersensitivity or intolerability to prednisolone (or prednisone, or equivalent), TAC, or MMF at a dose of 1.25 g or below per day.

The above is a clinical trial exclusion criterion. Annotated with entity spans:
Known [Condition: hypersensitivity] or [Condition: intolerability] to [Drug: prednisolone] (or [Drug: prednisone], or equivalent), [Drug: TAC], or [Drug: MMF] at a dose of [Multiplier: 1.25 g or below per day].